一位婦產科醫師在看診時建議病人做子宮頸抹片檢查，在三段五級的預防層次（levels of prevention）中，這是屬於那一個層次？
A. 第一段第二級
B. 第二段第三級
C. 第三段第四級
D. 第三段第五級

正確答案：B. 第二段第三級